Male or female = 2 years of age;

The above is a clinical trial inclusion criterion. Annotated with entity spans:
[Person: Male] or [Person: female] [Value: = 2 years] of [Person: age];